What is mechanism of action of galunisertib?

Galunisertib is a transforming growth factor-β receptor type I kinase inhibitor (TGF-βRI). It was tested for treatment of solid cancers, including  glioblastoma and neuroblastoma, and liver fibrosis.